Clinical trial exclusion criterion:
temperature=37.1<U+2103> and infectious diseases

Entity relations:
- Has_value("temperature", "=37.1<U+2103>")
- OR("temperature", "infectious diseases")